Patients weighing <55kgs.

The above is a clinical trial exclusion criterion. Annotated with entity spans:
Patients [Measurement: weighing] [Value: <55kgs].